Clinical trial inclusion criterion:
therapy with aspirin and insulin;

Annotated entities:
- Drug: "aspirin"
- Drug: "insulin"